Clinical trial exclusion criterion:
Baseline ALT more than 3 times UNL

Annotated entities:
- Temporal: "Baseline"
- Measurement: "ALT"
- Value: "more than 3 times UNL"